Clinical trial inclusion criterion:
Subject's ability to lay in a supine position with their hands at their sides during CVP measurements

Entity relations:
- Has_index("during CVP measurements", "CVP measurements")
- Has_temporal("ability to lay in a supine position with their hands at their sides", "during CVP measurements")